What is inhibited by TH1579?

TH1579 is a best-in-class MTH1 inhibitor.